Clinical trial inclusion criterion:
Patient is pregnant, lactating, or planning to become pregnant within 12 months

Entity relations:
- Has_temporal("pregnant", "within 12 months")
- Has_mood("pregnant", "planning to become")
- OR("pregnant", "lactating", "pregnant")